Clinical trial inclusion criterion:
Chronic migraine: by ICHD-III (International Classification of Headache Disorder) criteria

Annotated entities:
- Condition: "Chronic migraine"
- Qualifier: "ICHD-III"
- Qualifier: "International Classification of Headache Disorder"